Clinical trial inclusion criterion:
Eastern Cooperative Oncology Group score 0-2

Entity relations:
- Has_value("Eastern Cooperative Oncology Group", "score 0-2")